Known allergy to any drug used

The above is a clinical trial exclusion criterion. Annotated with entity spans:
[Condition: Known allergy] to [Drug: any drug used]